Clinical trial exclusion criterion:
Unable to understand instructions for using pump in English

Annotated entities:
- Post-eligibility: "Unable to understand instructions for using pump in English"